關於兒童急性鏈球菌感染後腎臟發炎（acute poststreptococcal glomerulonephritis）的治療，下列敘述何者正確？
A. 由於為鏈球菌感染所引起的，因此給與適當的抗生素治療可以縮短病程
B. 高血壓的治療包括給與鈣離子抑制劑（calcium channel antagonists）或利尿劑（diuretics）
C. 限制鈉離子的攝取，主要是針對慢性腎臟病的預防
D. 類固醇為首選的治療藥物

正確答案：B. 高血壓的治療包括給與鈣離子抑制劑（calcium channel antagonists）或利尿劑（diuretics）